Clinical trial exclusion criteria:
Recanalized (TIMI I-III flow) IRA at coronary angiography.
Patients in whom TIMI-3 flow was not able to be established after wire crossing, balloon angioplasty or thrombectomy.
STEMI due to bypass-graft occlusion
Severe heart failure or cardiogenic shock

Annotated entities:
- Procedure: "Recanalized"
- Condition: "IRA"
- Procedure: "coronary angiography"
- Qualifier: "TIMI I-III flow"
- Non-representable: "Patients in whom TIMI-3 flow was not able to be established after wire crossing, balloon angioplasty or thrombectomy."
- Condition: "STEMI"
- Device: "bypass-graft"
- Condition: "occlusion"
- Qualifier: "Severe"
- Condition: "heart failure"
- Condition: "cardiogenic shock"